Severe health conditions such as cancer, failure of heart, lung, liver or kidney

The above is a clinical trial exclusion criterion. Annotated with entity spans:
[Condition: Severe health conditions] such as [Condition: cancer], [Condition: failure of heart], lung, liver or kidney